History of ischemic stroke or pulmonary thrombosis

The above is a clinical trial exclusion criterion. Annotated with entity spans:
[Temporal: History] of [Condition: ischemic stroke] or [Condition: pulmonary thrombosis]